No concomitant anti-cancer treatment is allowed

The above is a clinical trial inclusion criterion. Annotated with entity spans:
[Context_Error: No concomitant anti-cancer treatment is allowed]